Clinical trial inclusion criteria:
Histologically confirmed PD-L1 status defined NSCLC. Biopsy must be within 70 days of first treatment with pembrolizumab.
ECOG performance status 2.
Life expectancy > 12 weeks.
Uni-dimensionally measurable disease according to Response Evaluation Criteria in Solid Tumours (RECIST) v1.1
Computerised Tomography (CT) scan of chest and abdomen within 28 days of starting pembrolizumab.
Adequate haematological function:
Platelet count ≥100 x 109 /L.
Neutrophils ≥1.5 x 109/L.
Haemoglobin ≥ 9g/dL.
Adequate hepatic function:
Serum bilirubin ≤1.5 x upper limit of normal (ULN).
Serum transaminases ≤2.5 x ULN.
Adequate renal function: Creatinine clearance <1.5 times ULN concurrent with creatinine clearance >50 ml/min.
Provision of signed and dated, written informed consent prior to any study specific procedures, sampling and analyses.

Annotated entities:
- Condition: "NSCLC"
- Qualifier: "PD-L1 status"
- Procedure: "Biopsy"
- Temporal: "within 70 days of first treatment"
- Reference_point: "first treatment with pembrolizumab"
- Drug: "pembrolizumab"
- Measurement: "ECOG performance status"
- Value: "2"
- Observation: "Life expectancy"
- Measurement: "Response Evaluation Criteria in Solid Tumours (RECIST) v1.1"
- Value: "Uni-dimensionally measurable"
- Condition: "disease"
- Context_Error: "disease"
- Procedure: "Computerised Tomography (CT) scan of chest and abdomen"
- Temporal: "within 28 days of starting pembrolizumab"
- Reference_point: "starting pembrolizumab"
- Drug: "pembrolizumab"
- Parsing_Error: "Adequate haematological function:"
- Measurement: "Platelet count"
- Value: "≥100 x 109 /L"
- Measurement: "Neutrophils"
- Value: "≥1.5 x 109/L"
- Measurement: "Haemoglobin"
- Value: "≥ 9g/dL"
- Parsing_Error: "Adequate hepatic function:"
- Measurement: "Serum bilirubin"
- Value: "≤1.5 x upper limit of normal (ULN)"
- Measurement: "Serum transaminases"
- Value: "≤2.5 x ULN"
- Measurement: "Creatinine clearance"
- Value: "<1.5 times ULN"
- Temporal: "concurrent"
- Measurement: "creatinine clearance"
- Value: ">50 ml/min"
- Measurement: "renal function"
- Value: "Adequate"
- Post-eligibility: "Provision of signed and dated, written informed consent prior to any study specific procedures, sampling and analyses."
- Non-query-able: "Provision of signed and dated, written informed consent prior to any study specific procedures, sampling and analyses."